一位54歲男性，過去無全身性疾病病史，亦無特殊不適，但其家人注意到他的臉總是紅紅的，身體檢查顯示臉部泛紅，血壓 130/86 mmHg，脾臟在左肋緣下1指幅可觸摸到。抽血檢查發現血紅素19.5 gm/dL，血比容60%，白血球12500/µL，neutrophil 
 73%，monocyte 6%，lymphocyte 20%，eosinophil 1%，血小板546000/µL，血清中erythropoietin 3 mIU/µL（正常3.7～
 5），血球細胞有JAK2基因突變。對此病人最適當的治療為何？
A. hydroxyurea
B. anagrelide
C. radioactive phosphorus 32P
D. phlebotomy

正確答案：D. phlebotomy